No significant abnormalities in ECG per investigator judgment.

The above is a clinical trial inclusion criterion. Annotated with entity spans:
[Subjective_judgement: No significant abnormalities in ECG per investigator judgment.]